Clinical trial inclusion criterion:
Any patients that will be submitted to phacoemulsification surgery in the Hospital de Clinicas of State University of Campinas (BRAZIL)

Entity relations:
- Has_mood("phacoemulsification surgery", "will be submitted to")
- AND("phacoemulsification surgery", "Hospital de Clinicas of State University of Campinas (BRAZIL)")